HIV-1 infected males or females

The above is a clinical trial inclusion criterion. Annotated with entity spans:
[Condition: HIV-1 infected] [Person: males] or [Person: females]